What is TSA-Seq used for?

TSA-Seq is used as a cytological ruler to calculate relative distances between nuclear elements in 3D genome organization maps.